下列有關攝護腺癌（adenocarcinoma of prostate）的診斷，何者錯誤？
A. 早期大多數沒有症狀
B. 良性攝護腺肥大（BPH）手術後，仍可能發生攝護腺癌
C. 核磁共振造影（MRI）是目前診斷攝護腺癌最準確的方法
D. 50 歲以上男性應每年定期作肛門指診，合併血清攝護腺特定抗原（PSA）偵測

正確答案：C. 核磁共振造影（MRI）是目前診斷攝護腺癌最準確的方法